Patient is receiving immunosuppressive therapy or has known immunosuppressive or autoimmune disease (e.g., human immunodeficiency virus, systemic lupus erythematous, etc.)

The above is a clinical trial inclusion criterion. Annotated with entity spans:
Patient is receiving [Procedure: immunosuppressive therapy] or has known [Condition: immunosuppressive] or [Condition: autoimmune disease] (e.g., [Condition: human immunodeficiency virus], [Condition: systemic lupus erythematous], etc.)